Supine systolic blood pressure <85 mm Hg or >200 mm Hg at screening.

The above is a clinical trial exclusion criterion. Annotated with entity spans:
[Qualifier: Supine] [Measurement: systolic blood pressure] [Value: <85 mm Hg] or [Value: >200 mm Hg] at screening.